Clinical trial exclusion criterion:
• Diabetes duration >12 years

Annotated entities:
- Condition: "Diabetes"
- Temporal: ">12 years"